在未致敏（unsensitized）的病患，進行器官移植手術，初期的排斥反應與何者有關？
A. 捐贈者的 T 細胞
B. 捐贈者的自然殺手細胞（natural killer cell）
C. 捐贈者的樹狀細胞（dendritic cell）
D. 捐贈者的漿細胞（plasma cell）

正確答案：C. 捐贈者的樹狀細胞（dendritic cell）